Clinical trial exclusion criterion:
Planned cardiac surgery or planned major non cardiac surgery

Annotated entities:
- Procedure: "cardiac surgery"
- Mood: "planned"
- Mood: "Planned"
- Qualifier: "major"
- Procedure: "non cardiac surgery"